type 1 and 2 diabetic patients

The above is a clinical trial inclusion criterion. Annotated with entity spans:
[Qualifier: type 1] and 2 [Condition: diabetic] patients